Clinical trial inclusion criterion:
Patient able to receive neuraxial analgesia

Entity relations:
- Has_mood("neuraxial analgesia", "able to receive")